Clinical trial inclusion criterion:
women and men between 18 - 80 years of age

Entity relations:
- Has_value("age", "between 18 - 80 years")
- OR("women", "men")